Which network analysis method can you use for prioritization of metabolic disease genes?

metPropagate is a network-guided propagation of metabolomic information for prioritization of metabolic disease genes.  metPropagate was able to prioritize at least one causative gene in the top 20th percentile of candidate genes for 92% of patients with known IEMs.